Clinical trial inclusion criterion:
Patients must be more than 18 years of age and referred for coronary angiography

Entity relations:
- Has_value("age", "more than 18 years")
- Has_mood("coronary angiography", "referred for")